Patients with PA and stage I (140-159/90-99 mmHg) hypertension

The above is a clinical trial inclusion criterion. Annotated with entity spans:
Patients with [Condition: PA] and [Qualifier: stage I] (140-159/90-99 mmHg) [Condition: hypertension]